Clinical trial exclusion criterion:
Other serious illness or medical conditions

Entity relations:
- OR("serious illness", "medical conditions")